Clinical trial exclusion criterion:
Subjects on chronic transfusion program

Annotated entities:
- Procedure: "transfusion program"
- Qualifier: "chronic"
- Multiplier: "chronic"